En relación a la hiperplasia suprarrenal congénita clásica indique la respuesta correcta:
1. La falta de tratamiento provoca una virilización postnatal progresiva.
2. Para el diagnóstico es necesario un test de estimulación con ACTH.
3. En el sexo masculino los genitales externos son ambiguos al nacimiento.
4. En el sexo femenino los genitales externos son normales al nacimiento.
5. El tratamiento prenatal con glucocorticoides evita la enfermedad.

Respuesta correcta: 1. La falta de tratamiento provoca una virilización postnatal progresiva.